Age 60-80 years

The above is a clinical trial inclusion criterion. Annotated with entity spans:
[Person: Age] [Value: 60-80 years]